Clinical trial exclusion criterion:
Serum creatinine > 3 mg/dl

Entity relations:
- Has_value("Serum creatinine", "> 3 mg/dl")